Primary sclerosing cholangitis

The above is a clinical trial exclusion criterion. Annotated with entity spans:
[Condition: Primary sclerosing cholangitis]